Clinical trial exclusion criteria:
Patients who may receive therapeutically effective doses via an external beam approach to the lesion of interest as specified by MSKCC Radiation Oncology Department dose constraint criteria.
Patients with kyphoplasty cement or hardware that would preclude effective catheter placement.
Patients with paraspinal extension of disease with visceral involvement.
Abnormal complete blood count. Any of the following:
Platelet count < 75,000/ml
Hb level < 9gm/dl
WBC < 3.5/ml
Abnormal coagulation profile: INR > 2.5 and/or PTT > 80
Patients who are on anticoagulation medication that may not be safely held for the procedure (≥ 5 days for antiplatelet agents and warfarin; ≥ 24 hours for low-molecular weight heparin formulations) will be excluded.
Contraindications to general anesthesia

Annotated entities:
- Measurement: "MSKCC Radiation Oncology Department dose constraint criteria"
- Condition: "may receive therapeutically effective doses via an external beam approach to the lesion of interest"
- Qualifier: "therapeutically effective"
- Procedure: "doses"
- Procedure: "external beam"
- Context_Error: "Patients who may receive therapeutically effective doses via an external beam approach to the lesion of interest as specified by MSKCC Radiation Oncology Department dose constraint criteria"
- Device: "kyphoplasty cement"
- Device: "kyphoplasty hardware"
- Qualifier: "preclude effective catheter placement"
- Condition: "paraspinal extension of disease"
- Condition: "visceral involvement"
- Measurement: "complete blood count"
- Value: "Abnormal"
- Condition: "Abnormal complete blood count"
- Undefined_semantics: "Abnormal complete blood count"
- Parsing_Error: "Any of the following:"
- Measurement: "Platelet count"
- Value: "< 75,000/ml"
- Measurement: "Hb level"
- Value: "< 9gm/dl"
- Measurement: "WBC"
- Value: "< 3.5/ml"
- Measurement: "coagulation profile"
- Value: "Abnormal"
- Condition: "Abnormal coagulation profile"
- Measurement: "INR"
- Value: "> 2.5"
- Measurement: "PTT"
- Value: "> 80"
- Drug: "anticoagulation medication"
- Undefined_semantics: "anticoagulation medication"
- Qualifier: "may not be safely held for the procedure"
- Subjective_judgement: "may not be safely held for the procedure"
- Multiplier: "≥ 5 days"
- Drug: "antiplatelet agents"
- Drug: "warfarin"
- Multiplier: "≥ 24 hours"
- Drug: "low-molecular weight heparin"
- Condition: "Contraindications to general anesthesia"
- Procedure: "general anesthesia"